有關骨髓炎（osteomyelitis）的敘述，何者最正確？
A. 成人骨髓炎最常見的原因是血行性感染（hematogenous infection）
B. 當細菌在骨內形成菌落繁殖會破壞骨組織的血液循環，產生壞死，稱為包殼骨（involucrum）
C. 慢性骨髓炎的病人，其血中白血球大多會超過 12000/mm3
D. 對於靜脈注射毒癮者感染骨髓炎，優先考慮的致病菌種分別為金黃色葡萄球菌（Staphylococcus aureus），綠膿桿菌

正確答案：D. 對於靜脈注射毒癮者感染骨髓炎，優先考慮的致病菌種分別為金黃色葡萄球菌（Staphylococcus aureus），綠膿桿菌